Clinical trial inclusion criterion:
2. Patient with breast cancer, histologically proven, metastatic or locally advanced

Annotated entities:
- Parsing_Error: "2."
- Condition: "breast cancer"
- Procedure: "histologically"
- Value: "proven"
- Qualifier: "metastatic"
- Qualifier: "locally advanced"